Clinical trial exclusion criterion:
Bleeding from gastric varices, with or without esophageal varices

Entity relations:
- AND("Bleeding", "gastric varices")
- AND("Bleeding", "esophageal varices")